Clinical trial inclusion criterion:
American Society of Anesthesiology Physical Class 1-3.

Entity relations:
- Has_value("American Society of Anesthesiology Physical Class", "1-3")